Underlying comorbidities that contraindicate the procedure (including but not limited to polycythemia, coagulation disorder, or malignancy).

The above is a clinical trial exclusion criterion. Annotated with entity spans:
[Condition: Underlying comorbidities] that [Qualifier: contraindicate the procedure] (including but not limited to [Condition: polycythemia], [Condition: coagulation disorder], or [Condition: malignancy]).